Clinically significant active suicidal ideation or self-injurious behavior necessitating immediate treatment, as determined by the investigator.

The above is a clinical trial exclusion criterion. Annotated with entity spans:
Clinically significant [Qualifier: active] [Condition: suicidal ideation] or [Condition: self-injurious behavior] necessitating [Qualifier: immediate] [Procedure: treatment], as determined by the investigator.